Clinical trial exclusion criterion:
allergy to Paclitaxel

Annotated entities:
- Drug: "Paclitaxel"
- Condition: "allergy"